Age > 50 years

The above is a clinical trial inclusion criterion. Annotated with entity spans:
[Person: Age] [Value: > 50 years]